下列何種產物具有調理作用（opsonization），可增強macrophage、neutrophils的吞噬作用？
A. Interferon
B. IL-1
C. TNF-α
D. complement

正確答案：D. complement